Clinical trial exclusion criterion:
currently using medications containing lidocaine

Annotated entities:
- Temporal: "currently"
- Drug: "medications containing lidocaine"